Audible abnormalities by chest examination compatible with pneumonia

The above is a clinical trial inclusion criterion. Annotated with entity spans:
[Observation: Audible abnormalities] by [Procedure: chest examination] compatible with [Condition: pneumonia]